La probabilidad de cometer un error de tipo I en un test de hipótesis se puede controlar prefijando un valor alfa. ¿Qué probabilidad es la que fija alfa?:
1. La probabilidad de no rechazar la hipótesis nula siendo que esta es cierta.
2. La probabilidad de no rechazar la hipótesis nula siendo que esta es falsa.
3. La probabilidad de rechazar la hipótesis nula siendo que esta es cierta.
4. La probabilidad de rechazar la hipótesis nula siendo que esta es falsa.

Respuesta correcta: 3. La probabilidad de rechazar la hipótesis nula siendo que esta es cierta.